Clinical trial inclusion criterion:
Weight >1900g at time of delivery

Annotated entities:
- Measurement: "Weight"
- Value: ">1900g"
- Temporal: "at time of delivery"